Clinical trial exclusion criterion:
Subject has indeterminate, ulcerative, antibiotic-associated colitis.

Annotated entities:
- Condition: "colitis"
- Observation: "antibiotic-associated"
- Observation: "ulcerative"
- Observation: "indeterminate"